Clinical trial exclusion criterion:
Subject is considered to be a part of a vulnerable population (eg. prisoners or those without sufficient mental capacity).

Entity relations:
- Subsumes("part of a vulnerable population", "prisoners")
- OR("prisoners", "without sufficient mental capacity")